Signed written informed consent form

The above is a clinical trial inclusion criterion. Annotated with entity spans:
[Informed_consent: Signed written informed consent form]